What is the aim of the MitoCeption protocol?

The MitoCeption protocol directly and quantitatively transfer mitochondria, isolated from cell type A, to recipient cell type B.